Clinical trial exclusion criteria:
Age less than one year or over 18 years
Patients with renal impairment
Colistin use less than 72 hours

Annotated entities:
- Person: "Age"
- Value: "less than one year"
- Value: "over 18 years"
- Condition: "renal impairment"
- Drug: "Colistin"
- Temporal: "less than 72 hours"